Clinical trial exclusion criterion:
Medical condition with safety deemed to be category 3 or 4 when using a combined hormonal contraceptive, as determined by the Center for Disease Control Medical Eligibility Criteria: current or past history of breast cancer, severe decompensated cirrhosis, history of deep vein thrombosis or pulmonary embolus, diabetes with nephropathy/retinopathy/neuropathy or other vascular disease diagnosed more than 20 years ago, current symptomatic gallbladder disease, hypertension, ischemic heart disease, known thrombogenic mutations, hepatocellular adenoma, malignant hepatoma, multiple risk factors for atherosclerotic cardiovascular disease, multiple sclerosis with prolonged immobility, history of peripartum cardiomyopathy, cigarette smoking and =35yo, history of complicated solid organ transplant, history of stroke, history of superficial venous thrombosis not associated with catheter, systemic lupus erythematosus with positive antiphospholipid antibodies, valvular heart disease complicated by pulmonary hypertension or atrial fibrillation or bacterial endocarditis, and acute viral hepatitis

Annotated entities:
- Temporal: "current"
- Temporal: "past"
- Temporal: "history"
- Condition: "breast cancer"
- Qualifier: "severe"
- Qualifier: "decompensated"
- Condition: "cirrhosis"
- Temporal: "history"
- Condition: "deep vein thrombosis"
- Condition: "pulmonary embolus"
- Condition: "diabetes"
- Condition: "nephropathy"
- Condition: "retinopathy"
- Condition: "neuropathy"
- Qualifier: "other"
- Condition: "vascular disease"
- Temporal: "more than 20 years ago"
- Temporal: "current"
- Qualifier: "symptomatic"
- Condition: "gallbladder disease"
- Condition: "hypertension"
- Condition: "ischemic heart disease"
- Condition: "thrombogenic mutations"
- Condition: "hepatocellular adenoma"
- Condition: "malignant hepatoma"
- Drug: "combined hormonal contraceptive"
- Multiplier: "multiple"
- Mood: "risk factors"
- Condition: "atherosclerotic cardiovascular disease"
- Condition: "multiple sclerosis"
- Condition: "prolonged immobility"
- Temporal: "history"
- Condition: "peripartum cardiomyopathy"
- Observation: "cigarette smoking"
- Value: "=35yo"
- Person: "yo"
- Procedure: "complicated solid organ transplant"
- Temporal: "history"
- Temporal: "history"
- Condition: "stroke"
- Temporal: "history"
- Condition: "superficial venous thrombosis"
- Qualifier: "not associated"
- Device: "catheter"
- Condition: "systemic lupus erythematosus"
- Value: "positive"
- Measurement: "antiphospholipid antibodies"
- Condition: "valvular heart disease"
- Condition: "pulmonary hypertension"
- Condition: "atrial fibrillation"
- Condition: "bacterial endocarditis"
- Condition: "acute viral hepatitis"
- Condition: "Medical condition"
- Value: "3 or 4"
- Measurement: "Center for Disease Control Medical Eligibility Criteria"
- Measurement: "safety category"